Clinical trial exclusion criterion:
Active infection requiring systemic treatment or any uncontrolled infection <=14 days prior to first dose of study treatment (with the exception of uncomplicated urinary tract infection or upper respiratory tract infection).

Annotated entities:
- Condition: "infection"
- Temporal: "Active"
- Procedure: "systemic treatment"
- Condition: "uncontrolled infection"
- Temporal: "<=14 days prior to first dose of study treatment"
- Reference_point: "first dose of study treatment"
- Qualifier: "any"
- Condition: "urinary tract infection"
- Qualifier: "uncomplicated"
- Negation: "with the exception of"
- Condition: "upper respiratory tract infection"